Clinical trial exclusion criterion:
Known liver failure (bilirubin >1.Sx upper limit of normal)

Annotated entities:
- Condition: "liver failure"
- Measurement: "bilirubin"
- Value: ">1.Sx upper limit of normal"